Clinical trial exclusion criterion:
Individuals with non-MRI compatible aneurysm clips

Annotated entities:
- Device: "aneurysm clips"
- Qualifier: "MRI compatible"
- Negation: "non"